alergy to fish, protamine, protamine derivates, history of Humulin N, Novolin N, Novolin NPH, Gensulin N, SciLin N, NPH Iletin II and isophane insulin intake

The above is a clinical trial exclusion criterion. Annotated with entity spans:
[Condition: alergy] to [Drug: fish], [Drug: protamine], [Drug: protamine derivates], [Temporal: history] of [Drug: Humulin N], [Drug: Novolin N], [Drug: Novolin NPH], [Drug: Gensulin N], [Drug: SciLin N], [Drug: NPH Iletin II] and [Drug: isophane insulin] intake